Clinical trial exclusion criterion:
Vulnerable patients (Patient referred to in Articles L. 1121-5 to L. 1121-8 and L. 1122-1-2 of the French Public Health Code)

Entity relations:
- Has_qualifier("Vulnerable patients", "Articles L. 1121-5 to L. 1121-8 and L. 1122-1-2 of the French Public Health Code")